一位 6 週大之足月嬰兒因漸進式的咳嗽、呼吸喘快和略微發紺而就診，他的體溫正常、聽診發現雙側囉音，X 光呈現過度充氣（hyperinflation）及微量的間質浸潤，而血液檢查則有嗜伊紅球上升 （eosinophilia）現象；此嬰兒之治療應包含下列何者？
A. clindamycin 投予 7 天
B. erythromycin 投予 14 天
C. ampicillin 投予 14 天
D. ampicillin 與 gentamicin 投予 7 天

正確答案：B. erythromycin 投予 14 天